Patients not capable or willing to provide informed consent

The above is a clinical trial exclusion criterion. Annotated with entity spans:
[Non-query-able: Patients not capable or willing to provide informed consent]